使用局部的轉位皮瓣（local rotational flaps）時有那些注意事項，但何者除外：
A. 轉位皮瓣的長與寬之比例
B. 縫合後轉位皮瓣周圍所承受的張力
C. 傷口包紮的鬆緊度
D. 縫線的顏色

正確答案：D. 縫線的顏色